下列那一種細胞常參與抗體依賴性細胞毒殺反應（antibody-dependent cell-mediated cytotoxicity,  ADCC）？
A. B 淋巴細胞
B. CD8 T 淋巴細胞
C. 自然殺手細胞（natural killer cell）
D. 肥大細胞（mast cell）

正確答案：C. 自然殺手細胞（natural killer cell）